History of immunocompromise, including a positive HIV test result.

The above is a clinical trial exclusion criterion. Annotated with entity spans:
[Temporal: History] of [Condition: immunocompromise], including a [Value: positive] [Measurement: HIV test] result.